Patient's weight and height and abdominal circumference

The above is a clinical trial inclusion criterion. Annotated with entity spans:
Patient's [Procedure: weight] and [Procedure: height] and [Procedure: abdominal circumference]